急性骨髓性白血病人，帶有下列何種染色體或基因異常者，預後不好？
A. NPM1 mutation
B. FLT3-ITD
C. CEBPA mutation
D. inv(16)

正確答案：B. FLT3-ITD